Diagnosis of a primary or secondary HA disorder other than PTHA

The above is a clinical trial exclusion criterion. Annotated with entity spans:
Diagnosis of a [Qualifier: primary] or [Qualifier: secondary] [Condition: HA disorder] [Negation: other than] [Condition: PTHA]